Clinical trial inclusion criterion:
Moderate to severe CD define as HBI score > 4.

Entity relations:
- Has_value("HBI score", "> 4")
- Has_qualifier("CD", "Moderate")
- Subsumes("Moderate", "HBI score")
- OR("Moderate", "severe")